Teeth that are not restorable

The above is a clinical trial exclusion criterion. Annotated with entity spans:
[Observation: Teeth that are not restorable]